Inability to use PCA

The above is a clinical trial exclusion criterion. Annotated with entity spans:
[Condition: Inability to use] [Procedure: PCA]